Clinical trial inclusion criterion:
age > 18

Annotated entities:
- Person: "age"
- Value: "> 18"